How long in bp is the human pseudoautosomal region 2 (PAR2)?

The human pseudoautosomal region 2 (PAR2), which is located in the long arm of chromosome 9 (LTR6B) and consists of 32 exons, is320-kb long.